Clinical trial inclusion criterion:
Free of obvious health problems as established by medical history and clinical examination before entering into the study.

Annotated entities:
- Condition: "health problems"
- Qualifier: "obvious"
- Negation: "Free"